Losigamone can be used for treatment of which disease?

Losigamone is sometimes used as an add-on therapy for epilepsy.